Clinical trial inclusion criterion:
Able to walk and complete lower-limb tests with both legs

Entity relations:
- Has_qualifier("Able to complete lower-limb tests", "with both legs")
- OR("Able to walk", "Able to complete lower-limb tests")